Los fragmentos de Okazaki son:
1. El resultado de la proteólisis de la DNA polimerasa.
2. Fragmentos de DNA que se sinsetizan en dirección 3´->5.
3. Fragmentos de RNA que actúan como cebadores.
4. Fragmentos de DNA en la hebra retrasada.

Respuesta correcta: 4. Fragmentos de DNA en la hebra retrasada.